Clinical trial inclusion criterion:
Age: >=40 and <=80 years of age at Screening (Visit 1).

Annotated entities:
- Person: "Age"
- Value: ">=40 and <=80 years"
- Person: "age"
- Temporal: "at Screening"
- Reference_point: "Screening"